Clinical trial exclusion criterion:
Known or suspected allergy to octreotide

Annotated entities:
- Condition: "allergy"
- Mood: "suspected"
- Mood: "Known"
- Drug: "octreotide"